Clinically significant abnormal liver function tests at screening

The above is a clinical trial exclusion criterion. Annotated with entity spans:
[Qualifier: Clinically significant] [Value: abnormal] [Measurement: liver function tests] [Temporal: at screening]